以下何種職業暴露最常被報告造成股骨頭之壞死現象？
A. 聯苯胺作業
B. 全身性振動
C. 低溫暴露
D. 異常氣壓

正確答案：D. 異常氣壓